Clinical trial exclusion criterion:
History of immunologically mediated disease (e.g., inflammatory bowel disease, idiopathic thrombocytopenic purpura, lupus erythematosus, autoimmune hemolytic anemia, scleroderma, severe psoriasis, rheumatoid arthritis).

Entity relations:
- Has_qualifier("psoriasis", "severe")
- Subsumes("immunologically mediated disease", "inflammatory bowel disease")
- OR("inflammatory bowel disease", "idiopathic thrombocytopenic purpura", "rheumatoid arthritis", "psoriasis", "scleroderma", "autoimmune hemolytic anemia", "lupus erythematosus")